下列何者不形成骨盆入口（pelvic inlet）的界限？
A. 薦岬（promontory）
B. 髂嵴（iliac crest）
C. 恥骨嵴（pubic crest）
D. 弓狀線（arcuate line）

正確答案：B. 髂嵴（iliac crest）